Clinical trial exclusion criterion:
Mean pulmonary artery pressures =40mmHG and PVR >4 woods units as assessed by right heart catheterization.

Annotated entities:
- Measurement: "Mean pulmonary artery pressures"
- Value: "=40mmHG"
- Measurement: "PVR"
- Value: ">4 woods units"
- Condition: "right heart catheterization"